Patients with significant clinical abnormalities in CNS, respiratory or cardiovascular function, which in the investigators judgement prevents participation in the study

The above is a clinical trial exclusion criterion. Annotated with entity spans:
Patients with significant clinical [Condition: abnormalities in CNS], respiratory or cardiovascular function, which in the investigators judgement prevents participation in the study